BMI = 50 kg/m2

The above is a clinical trial inclusion criterion. Annotated with entity spans:
[Measurement: BMI] [Value: = 50 kg/m2]